Normal uterine cavity

The above is a clinical trial inclusion criterion. Annotated with entity spans:
[Qualifier: Normal] [Condition: uterine cavity]